Cuando un enzima cataliza una determinada reacción:
1. El enzima no se modifica, pero pierde su actividad catalítica.
2. Siempre requiere la participación de cofactores.
3. El enzima no se modifica y puede reutilizarse.
4. El enzima se desnaturaliza para facilitar la unión con el sustrato.

Respuesta correcta: 3. El enzima no se modifica y puede reutilizarse.